NSAID and other analgesics used the 48 hours previous to the surgery

The above is a clinical trial exclusion criterion. Annotated with entity spans:
[Drug: NSAID] and [Qualifier: other] [Drug: analgesics] used the [Temporal: 48 hours previous to the surgery]